Past history of hypersensitivity to aripiprazole

The above is a clinical trial exclusion criterion. Annotated with entity spans:
Past history of [Condition: hypersensitivity] to [Drug: aripiprazole]